一位 43 歲孕婦，G1P0，妊娠 20 週時接受產前超音波檢查，發現胎兒頭部有「檸檬徵狀」（lemon sign），則要高度懷疑胎兒有下列何種疾病？
A. 脊柱裂（spina bifida）
B. 無腦兒（anencephaly）
C. 水腦（hydrocephaly）
D. 臍膨出（omphalocele）

正確答案：A. 脊柱裂（spina bifida）